Clinical trial inclusion criterion:
Functioning telephone

Annotated entities:
- Non-query-able: "Functioning telephone"